Clinical trial inclusion criterion:
Subject has a bone stock compromised by disease, infection or prior implantation which cannot provide adequate support and/or fixation to the devices.

Annotated entities:
- Condition: "bone stock compromised"
- Condition: "disease"
- Condition: "infection"
- Procedure: "implantation"
- Temporal: "prior"
- Observation: "adequate support"
- Procedure: "fixation to the devices"
- Measurement: "cannot"